El glucagón y la adrenalina tienen en común:
1. Activar la degradación de glucógeno en hígado y músculo.
2. Facilitar la entrada de glucosa en todas las células del organismo.
3. Activar la síntesis de ácidos grasos.
4. Siempre liberarse a la sangre.
5. Activar la glicólisis.

Respuesta correcta: 1. Activar la degradación de glucógeno en hígado y músculo.